CRP（cAMP receptor protein）是 lac operon 基因表現的一個主要調控因子，下列何者是 CRP 適的描述？
A. CRP 協助 RNA 聚合酶（RNA polymerase）與 lac-啟動子（lac-promoter）的結合
B. CRP 與 lac operon 的結合只能在葡萄糖存在下進行
C. CRP 與 lac operon 的結合可防止 lac-抑制子（lac-repressor）與 operator 的結合
D. CRP 與 lac-抑制子（lac-repressor）競爭 operator

正確答案：A. CRP 協助 RNA 聚合酶（RNA polymerase）與 lac-啟動子（lac-promoter）的結合